Clinical trial exclusion criterion:
Asthma: Subjects with a current diagnosis of asthma. (Subjects with a prior history of asthma are eligible if they also have a current diagnosis of COPD).

Entity relations:
- Has_temporal("asthma", "current")
- Has_temporal("Asthma", "current")
- Has_temporal("asthma", "history")
- Has_temporal("asthma", "prior")